Clinical trial exclusion criterion:
Prior trombosis or myocardial infarction, congenital coagulation disorder, use of anti-coagulants prior to surgery, prior thoracic surgery, pregnancy, pre-operative fibrinogen concentration <1g/L

Annotated entities:
- Condition: "trombosis"
- Temporal: "Prior"
- Condition: "myocardial infarction"
- Condition: "congenital coagulation disorder"
- Drug: "anti-coagulants"
- Temporal: "prior to surgery"
- Temporal: "prior"
- Procedure: "thoracic surgery"
- Condition: "pregnancy"
- Temporal: "pre-operative"
- Measurement: "fibrinogen concentration"
- Value: "<1g/L"